Clinical trial exclusion criterion:
History of post-abortion complication or infection

Annotated entities:
- Condition: "post-abortion complication"
- Condition: "post-abortion infection"
- Temporal: "History"